Clinical trial exclusion criterion:
comorbidities other than AF, which present an indication for anticoagulation;

Entity relations:
- AND("comorbidities", "AF")
- AND("indication", "anticoagulation")
- Has_negation("AF", "other than")
- AND("comorbidities", "indication")